Central Vein Sign is characteristic to which disease?

Central vein sign on FLAIR* magnetic resonance imaging  is highly specific and sensitive for multiple sclerosis.